What is RiboTag profiling?

RiboTag is a flexible tool for measuring the translational state of targeted cells in heterogeneous cell cultures.